有關甲狀腺功能低下（hypothyroidism）與精神疾病的關聯性，下列何者錯誤？
A. 針對甲狀腺功能低下所引發的精神症狀，應該一開始就使用高劑量的抗精神病藥物
B. 甲狀腺功能低下可能引發認知障礙
C. 甲狀腺功能低下可能是難治型憂鬱症  (treatment refractory depression) 的原因之一
D. 甲狀腺功能低下可能引發憂鬱情緒

正確答案：A. 針對甲狀腺功能低下所引發的精神症狀，應該一開始就使用高劑量的抗精神病藥物